有關德國麻疹病毒（rubella virus）的敘述，下列何者錯誤？
A. 人類為唯一宿主
B. 只有一種血清型
C. 可施打MMR疫苗預防感染
D. 常規以喉頭拭子（throat swab）培養病毒，做為診斷感染的根據

正確答案：D. 常規以喉頭拭子（throat swab）培養病毒，做為診斷感染的根據